Clinical trial exclusion criterion:
The participant has received transcranial magnetic stimulation within 6 months.The participant has received selegiline, pethidine, tramadol, reserpine or methyldopa within 90 days.

Entity relations:
- Has_temporal("transcranial magnetic stimulation", "within 6 months")
- Has_temporal("selegiline", "within 90 days")
- OR("selegiline", "reserpine", "tramadol", "pethidine", "methyldopa")